下列那一項物質存在革蘭氏陰性細菌中而不存在革蘭氏陽性細菌？
A. Peptidoglycan（胜肽聚醣）
B. Lipid A
C. Capsule（莢膜）
D. l Flagella（鞭毛）

正確答案：B. Lipid A